Clinical trial exclusion criterion:
Severe NC confounding conditions (stroke, head injury, or developmental learning disability).

Annotated entities:
- Condition: "stroke"
- Condition: "head injury"
- Condition: "developmental learning disability"
- Condition: "NC confounding conditions"